當抗原穿過皮膚進入組織時，B 細胞及 T 細胞免疫反應在何處發生？
A. 皮下組織
B. 骨髓
C. 淋巴結
D. 脾臟

正確答案：C. 淋巴結